Se denomina modelo cúbico de la Estructura del Intelecto o de la Inteligencia:
1. Al modelo de capacidades primarias propuesto por Thurstone.
2. Al modelo de capacidades independientes propuesto por J.P. Guilford.
3. A la estructura jerárquica tridimensional que presenta la inteligencia.
4. Al modelo más defendido en la actualidad por autores relevantes en el estudio de la estructura de la inteligencia.

Respuesta correcta: 2. Al modelo de capacidades independientes propuesto por J.P. Guilford.